Hepatic impairment

The above is a clinical trial exclusion criterion. Annotated with entity spans:
[Condition: Hepatic impairment]